Prior lung transplant, LVRS, median sternotomy, bullectomy or lobectomy.

The above is a clinical trial exclusion criterion. Annotated with entity spans:
[Temporal: Prior] [Procedure: lung transplant], [Procedure: LVRS], [Procedure: median sternotomy], [Procedure: bullectomy] or [Procedure: lobectomy].